Clinical trial exclusion criterion:
Lack of understanding of the study

Annotated entities:
- Observation: "Lack of understanding of the study"